SCI ( =1 month of injury)

The above is a clinical trial inclusion criterion. Annotated with entity spans:
[Condition: SCI] ( [Temporal: =1 month of injury])